一位 27 歲男性國小教師，主訴長期感覺人生乏味，認為生命是一趟痛苦旅程，毫無趣味可言。雖然在校表現優異、同儕關係良好，但仍認為自己從未成功過，生下來註定是個失敗者，從未有過成就感；空虛、矛盾、沒有方向感、缺乏熱情就是他一生的寫照。該名患者最有可能之臨床診斷為下列何者？
A. 雙極性疾患重鬱發作（bipolar disorder, major depressive episode）
B. 重鬱症（major depressive disorder）
C. 情緒低落症（dysthymic disorder）
D. 循環性情感疾患（cyclothymic disorder）

正確答案：C. 情緒低落症（dysthymic disorder）